Clinical trial exclusion criterion:
The current OCD symptoms are too severe that the patient cannot finish the evaluation or receive the ERP

Annotated entities:
- Condition: "OCD symptoms"
- Qualifier: "severe"